54歲男性有糖尿病史多年，至泰國旅遊一個月，3天前返臺，因發燒及咳嗽有痰2天至急診就診。胸部X光發現右上肺有大片的實質浸潤（consolidation），腹部電腦斷層發現有脾臟膿瘍，痰液及由脾臟引流的膿瘍經革 蘭氏染色檢查發現有細胞內革蘭氏陰性桿菌，下列何者為這位病人最可能的致病菌？
A. Pseudomonas aeruginosa
B. Haemophilus influenzae
C. Burkholderia pseudomallei
D. Escherichia coli

正確答案：C. Burkholderia pseudomallei